Clinical trial exclusion criterion:
20. Inadequate venous access

Annotated entities:
- Parsing_Error: "20."
- Device: "venous access"
- Qualifier: "Inadequate"